Clinical trial inclusion criterion:
No more than 72 hours has elapsed since the first positive blood culture collection.

Annotated entities:
- Temporal: "No more than 72 hours since the first positive blood culture collection"
- Reference_point: "the first positive blood culture collection"
- Value: "positive"
- Measurement: "blood culture collection"